Clinical trial exclusion criterion:
Active malignancy or history of malignancy.

Entity relations:
- Has_temporal("malignancy", "history")
- Has_qualifier("malignancy", "Active")
- OR("malignancy", "malignancy")